Clinical trial exclusion criterion:
Pregnant/breast-feeding women

Entity relations:
- OR("Pregnant", "breast-feeding")